後眼部玻璃體切除術（vitrectomy）一般是經由何處進入眼內？
A. 玻璃體基底部（vitreous base）
B. 鋸齒緣（ora serrata）
C. 皺摺部（pars plicata）
D. 平坦部（pars plana）

正確答案：D. 平坦部（pars plana）